關於癲癇手術（epilepsy surgery）的敘述，下列何者錯誤？
A. Rasmussen encephalitis以半邊大腦切除術（hemispherectomy）為主
B. 失張發作（atonic seizure）以胼胝體切斷術（corpus callosotomy）為主
C. 兒童失神性癲癇（childhood absence epilepsy）以迷走神經刺激術（vagus nerve stimulation）為主
D. 內側顳葉硬化症（medial temporal sclerosis）以顳葉切除術（temporal lobectomy）或杏仁體-海馬迴切除術

正確答案：C. 兒童失神性癲癇（childhood absence epilepsy）以迷走神經刺激術（vagus nerve stimulation）為主